Meet one of the above RA flare requirements

The above is a clinical trial exclusion criterion. Annotated with entity spans:
Meet [Multiplier: one of] the above [Condition: RA flare requirements]